Clinical trial inclusion criterion:
Males or non-pregnant, non-nursing females

Entity relations:
- Has_negation("pregnant", "non-")
- Has_negation("nursing", "non-")
- OR("Males", "pregnant")